Las aminoacil-tRNA sintetasas:
1. Unen el aminoácido al codón.
2. Unen el aminoácido al extremo 3´del tRNA.
3. Unen el aminoácido al brazo del anticodón.
4. No son específicas, ni para el tRNA ni para el aminoácido.

Respuesta correcta: 2. Unen el aminoácido al extremo 3´del tRNA.